Contraindication to enoxaparin

The above is a clinical trial exclusion criterion. Annotated with entity spans:
[Condition: Contraindication] to [Drug: enoxaparin]